Clinical trial inclusion criterion:
If female and of childbearing potential, are willing to use adequate contraception (hormonal, barrier method, abstinence) prior to study entry and for the duration of study participation.

Annotated entities:
- Person: "female"
- Condition: "childbearing potential"
- Observation: "willing to"
- Procedure: "contraception"
- Drug: "hormonal"
- Procedure: "barrier method"
- Procedure: "abstinence"
- Temporal: "for the duration of study participation"
- Temporal: "prior to study entry"
- Reference_point: "study entry"
- Reference_point: "study participation"